Cephalic presentation

The above is a clinical trial inclusion criterion. Annotated with entity spans:
[Condition: Cephalic presentation]